Clinical trial exclusion criterion:
previous LAA ligation during cardiac surgery;

Annotated entities:
- Procedure: "LAA ligation"
- Procedure: "cardiac surgery"